Clinical trial exclusion criterion:
Gadolinium intolerance

Entity relations:
- AND("intolerance", "Gadolinium")